Clinical trial exclusion criterion:
The patient has received chemotherapy or immunotherapy for primary tumors

Entity relations:
- AND("chemotherapy", "primary tumors")
- OR("chemotherapy", "immunotherapy")